What eye disease(s) are associated with ocular toxoplasmosis?

yes, ocular toxoplasmosis is associated with retinochoroiditis.